急診來了一位 35 歲女性，主訴突然出現頭痛、視力模糊以及看東西有黑影，追溯她的病史，患者無重大疾病或重大手術病史，已結婚五年，沒有懷孕史，常因月經週期不規則求醫，身體檢查發現眼球活動正常，但視野有兩顳側半盲，根據上列發現最有可能的診斷為：
A. 高血壓性腦內血腫（hypertensive intracranial hematoma）
B. 動靜脈畸型破裂出血（arteriovenous malformation rupture and bleeding）
C. 松果體腫瘤出血（pineal region tumor bleeding）
D. 腦下垂體腦瘤出血（pituitary apoplexy）

正確答案：D. 腦下垂體腦瘤出血（pituitary apoplexy）